Clinical trial exclusion criterion:
the history of thrombocytopenia or other thrombocytopenia with a definite diagnosis

Annotated entities:
- Condition: "thrombocytopenia"
- Temporal: "history"
- Qualifier: "other"
- Condition: "thrombocytopenia"